去勢治療失	的（castration-resistant）攝護腺癌（prostate cancer），其藥物治療不包括下列何者？
A. flutamide
B. enzalutamide
C. abiraterone acetate
D. docetaxel

正確答案：A. flutamide